造成 recurrent spontaneous abortion 的原因很多，下列那項因素所占的比例最高？
A. 免疫因素（immunologic factors）
B. 遺傳因素（genetic factors）
C. 解剖結構因素（anatomic factors）
D. 內分泌因素（endocrine factors）

正確答案：A. 免疫因素（immunologic factors）